下列有關骨肉瘤的化學治療的敘述，何者正確？
A. 效果良好，可取代手術
B. 可減少肺轉移，改善存活率
C. 加上輻射治療的效果最佳
D. 加上截肢為目前主要治療

正確答案：B. 可減少肺轉移，改善存活率